下列那一個腺體所分泌之激素多為脂溶性？
A. 胃（stomach）
B. 心臟（heart）
C. 胰臟（pancreas）
D. 腎上腺皮質（adrenal cortex）

正確答案：D. 腎上腺皮質（adrenal cortex）